下列有關消化性潰瘍治療藥物之敘述，何者錯誤？
A. 制酸劑（antacid）宜與第二型組織胺拮抗劑（H2 receptor antagonist）併用以增加療效
B. 長期服用第二型組織胺拮抗劑可能有陽痿、男性女乳症、月經失調等藥物不良反應
C. 長期服用質子幫浦抑制劑（proton pump inhibitor）可能會增加骨質疏鬆與髖骨骨折之機會
D. 制酸劑會抑制四環素（tetracycline）在胃腸道之吸收

正確答案：A. 制酸劑（antacid）宜與第二型組織胺拮抗劑（H2 receptor antagonist）併用以增加療效